Clinical trial inclusion criterion:
Eastern Cooperative Oncology Group (ECOG) score of 0, 1 or 2 (patients that spend less than 50% of time in bed during the day)

Annotated entities:
- Measurement: "Eastern Cooperative Oncology Group (ECOG) score"
- Value: "0, 1 or 2"
- Measurement: "spend time in bed during the day"
- Value: "less than 50%"